Clinical trial exclusion criterion:
Intracranial pathology: tumor, arteriovenous fistula or aneurysm.

Entity relations:
- Subsumes("Intracranial pathology", "tumor")
- OR("tumor", "aneurysm", "arteriovenous fistula")